Clinical trial inclusion criterion:
Absolute neutrophil count >= 1.5 x 109/L, Hemoglobin >= 9g/dL, Platelets>=100 x 109/L Bilirubin <= 1.5 x upper limit of normal AST/ALT <= 2.5 X upper limit of normal(5.0 x upper limit of normal, for subject with liver metastases) Creatinine<= 1.5 X UNL

Annotated entities:
- Measurement: "Absolute neutrophil count"
- Value: ">= 1.5 x 109/L"
- Measurement: "Hemoglobin"
- Value: ">= 9g/dL,"
- Measurement: "Platelets"
- Value: ">=100 x 109/L"
- Measurement: "Bilirubin"
- Value: "<= 1.5 x upper limit of normal"
- Measurement: "AST"
- Measurement: "ALT"
- Value: "<= 2.5 X upper limit of normal("
- Condition: "liver metastases"
- Value: "5.0 x upper limit of normal"
- Measurement: "Creatinine"
- Value: "<= 1.5 X UNL"
- Measurement: "AST"
- Measurement: "ALT"